Clinical trial inclusion criterion:
Previously treated or incurable disease without options for standard of care therapy

Annotated entities:
- Context_Error: "Previously treated or incurable disease without options for standard of care therapy"